What is clathrin?

Clathrin helps build small vesicles in order to safely transport molecules within and between cells.